5歲男童因為腹瀉3天，有脫水現象被送到急診。抽血檢查發現，血清鈉離子：142 mEq/L，鉀離子：3.6 mEq/L，氯離子：115 mEq/L，肌酐酸（creatinine）：1.1 mg/dL。動脈血液氣體分析為pH=7.12，PCO2=50 mmHg，HCO3-=14 mmol/L。下列何者正確？
A. normal anion gap metabolic acidosis with respiratory acidosis
B. high anion gap metabolic acidosis with respiratory acidosis
C. normal anion gap metabolic acidosis with respiratory compensation
D. normal anion gap metabolic acidosis with respiratory alkalosis

正確答案：A. normal anion gap metabolic acidosis with respiratory acidosis